Have a life expectancy of less than three months

The above is a clinical trial exclusion criterion. Annotated with entity spans:
Have a [Observation: life expectancy] of [Value: less than three months]